15 歲的 HBeAg 陽性之 B 型肝炎帶原男生，最近半年來血清 ALT 值持續偏高，且有 2 次均超過 150 IU/L，你打算給他作干擾素（interferon）治療。治療開始之前，下列何項檢查結果可能預測他對治療會有較佳的反應？
A. 血中 HBV DNA 濃度偏高
B. 血中 HBV DNA 濃度偏低
C. 肝組織只有極輕微肝炎活性
D. 血中 IgM anti-HBc 陰性

正確答案：B. 血中 HBV DNA 濃度偏低